Clinical trial exclusion criterion:
7. anticoagulation or immunosuppressive therapy

Annotated entities:
- Procedure: "anticoagulation therapy"
- Procedure: "immunosuppressive therapy"